下列有關頭部外傷病人之緊急處置，何者錯誤？
A. 不可使用低張溶液
B. 病人若出現低血壓時不要使用巴比妥酸鹽類（barbiturates）之藥物
C. 使用類固醇之藥物可以降低腦壓及保護腦組織
D. Mannitol 之使用劑量是 1 g/Kg

正確答案：C. 使用類固醇之藥物可以降低腦壓及保護腦組織